What is the difference in the roles of Tcf1 and Tcf3 during development?

Tcf3 antagonizes Wnt signaling, while Tcf1 enhances